Serum creatinine > 1.7mg/dL

The above is a clinical trial exclusion criterion. Annotated with entity spans:
[Measurement: Serum creatinine] [Value: > 1.7mg/dL]